Clinical trial inclusion criteria:
Of either gender, aged ≥19 and ≤70 years
Atopic dermatitis subjects who are coincident with Hanifin and Rajka diagnosis criteria
Subacute and chronic atopic subjects who have atopic dermatitis symptoms continually at least 6 months
Subjects with over moderate atopic dermatitis (SCORAD score > 20)
Subjects who understand and voluntarily sign an informed consent form

Annotated entities:
- Person: "aged"
- Value: "≥19 and ≤70 years"
- Condition: "Atopic dermatitis"
- Measurement: "Hanifin and Rajka diagnosis criteria"
- Condition: "dermatitis symptoms"
- Temporal: "continually at least 6 months"
- Grammar_Error: "and"
- Qualifier: "chronic"
- Qualifier: "Subacute"
- Condition: "atopic dermatitis"
- Measurement: "SCORAD score"
- Value: "> 20"
- Qualifier: "over moderate"
- Post-eligibility: "Subjects who understand and voluntarily sign an informed consent form"
- Non-query-able: "Subjects who understand and voluntarily sign an informed consent form"